若病人同時出現動眼（oculomotor）神經、外旋（abducent）神經、滑車（trochlear）神經與三叉神經之眼神經（ophthalmic nerve）與上頜神經（maxillary nerve）的缺損，其病灶部位最可能是在下列何處？
A. 眼窩（orbital fossa ）
B. 框上裂（superior orbital fissure）
C. 海綿竇（cavernous sinus）
D. 橋腦（pons）

正確答案：C. 海綿竇（cavernous sinus）